Clinical trial exclusion criterion:
Prior use of or a known allergy or hypersensitivity to pregabalin.

Annotated entities:
- Condition: "allergy"
- Condition: "hypersensitivity"
- Drug: "pregabalin"